A sufficient understood

The above is a clinical trial inclusion criterion. Annotated with entity spans:
[Non-representable: A sufficient understood]